下列有關萎縮（atrophy）的敘述，何者錯誤？
A. 在胚胎時期，某些組織已開始萎縮
B. 萎縮是組織或器官的細胞變小，但細胞數目並不會減少
C. 老年人腦部萎縮（senile atrophy）的主要原因是由於血液供應減少
D. 脂褐質（lipofuscin）可見於某些器官的萎縮

正確答案：B. 萎縮是組織或器官的細胞變小，但細胞數目並不會減少